一位 20 歲男性卡車司機，因最近兩週產生明顯之聽幻覺與視幻覺及被害妄想，且對家人有暴力行為，而由救護車緊急送到急診室。其一向身體不錯，最近半年來因須常開車而每天吸食多次安非他命，醫師擔心其精神病可能與其吸食安非他命有關。安非他命引起之精神病不易與精神分裂症區別，以下何者不是安非他命引起之精神病的特色？
A. 不適切之情感
B. 視幻覺
C. 活動量增加
D. 性慾增加

正確答案：A. 不適切之情感